Llamamos “Aprosexia” a :
1. La ausencia completa de atención.
2. La hipervigilancia atencional.
3. La incapacidad para distinguir unos estímulos de otros.
4. La fatigabilidad atencional.
5. La ausencia mental.

Respuesta correcta: 1. La ausencia completa de atención.